Has been in receipt of any licensed vaccine within 14 days prior to the first dose of study vaccine/placebo, plans to receive within 14 days after the first study vaccination, or plans to receive within 14 days before or after the second, third or fourth vaccination

The above is a clinical trial exclusion criterion. Annotated with entity spans:
Has been in receipt of any [Drug: licensed vaccine] [Temporal: within 14 days prior] to [Reference_point: the first dose of study vaccine/placebo], [Non-query-able: plans to] receive [Temporal: within 14 days after] the [Reference_point: first study vaccination], or [Non-query-able: plans to] receive [Temporal: within 14 days before or after] the [Reference_point: second, third or fourth vaccination]